De los fármacos reseñados, ¿Cuál de ellos NO actúa sobre el sistema renina-angiotensinaaldosterona?:
1. Atenolol.
2. Captopril.
3. Minoxidilo.
4. Eplerenona.
5. Aliskiren.

Respuesta correcta: 3. Minoxidilo.